Clinical trial exclusion criterion:
Renal or hepatic insufficiency

Annotated entities:
- Condition: "Renal insufficiency"
- Condition: "hepatic insufficiency"